6. Patients with moderately severe mental disease

The above is a clinical trial exclusion criterion. Annotated with entity spans:
6. Patients with [Qualifier: moderately severe] [Condition: mental disease]